淋巴結的發生中心（germinal center）是 B 細胞發育場所，但不包含下列那一項作用？
A. 抗原受器基因重組（antigen receptor gene rearrangement）
B. 抗體類型轉變（immunoglobulin class switching）
C. 體細胞超突變（somatic hypermutation）
D. 形成記憶細胞（memory cells）

正確答案：A. 抗原受器基因重組（antigen receptor gene rearrangement）